Have Paget's disease, heart disease, uncontrolled hypertension, renal disease, or other concomitant conditions that prohibit participation in exercises, risedronate therapy, or use of CaD supplements.

The above is a clinical trial exclusion criterion. Annotated with entity spans:
Have [Condition: Paget's disease], [Condition: heart disease], [Condition: uncontrolled hypertension], [Condition: renal disease], or [Condition: other concomitant conditions that prohibit participation in exercises], [Procedure: risedronate therapy], or use of [Drug: CaD supplements].